¿Cuál es la función de la helicasa en la replicación?:
1. Unirse al ADN monocatenario para evitar que se forme de nuevo la doble hélice.
2. Catalizar la unión de nucleótidos.
3. Corregir los errores que se producen en la replicación.
4. Sintetizar un cebador para iniciar la replicación.
5. Separar mecánicamente las hebras del ADN de doble cadena.

Respuesta correcta: 5. Separar mecánicamente las hebras del ADN de doble cadena.